Clinical trial exclusion criterion:
Significant anemia (Hb < 90 g/l)

Annotated entities:
- Condition: "anemia"
- Qualifier: "Significant"
- Measurement: "Hb"
- Value: "< 90 g/l"